Clinical trial exclusion criterion:
Pregnancy, age < 18, nursing, or documented allergy to naloxone

Entity relations:
- AND("allergy", "naloxone")
- Has_value("age", "< 18")
- OR("Pregnancy", "age", "nursing", "allergy")